Clinical trial inclusion criterion:
TPN cholestasis of at least 2.5 mg/dl

Entity relations:
- Has_multiplier("TPN cholestasis", "at least 2.5 mg/dl")